What is the role of histone variant H2A.W?

The histone variant H2A.W defines heterochromatin and promotes chromatin condensation in Arabidopsis